Clinical trial exclusion criterion:
Ever having received oral cholera vaccine.

Annotated entities:
- Drug: "oral cholera vaccine"